有關卵巢過度刺激症（OHSS），下列何者最正確？
A. 發生機會和取卵數無關
B. 早發性OHSS和外生性hCG無關
C. 發現寡尿時，趕快給予利尿劑
D. 腹水造成壓迫或呼吸困難，需抽掉腹水

正確答案：D. 腹水造成壓迫或呼吸困難，需抽掉腹水